What is the role of the IRE1a-XBP1 pathway?

The IRE1a-XBP1 pathway is a conserved adaptive mediator of the unfolded protein response. It is indispensable for the development of secretory cells by facilitating protein folding and enhancing secretory capacity.